那一種離子可避免卵細胞多次受精（polyspermy）？
A. 鎂
B. 鐵
C. 鈉
D. 鈣

正確答案：D. 鈣